Clinical trial exclusion criteria:
Women who are pregnant or breastfeeding (pregnancy defined as the state of a female after conception until the termination of gestation, confirmed by a positive human chorionic gonadotropin laboratory test (> 5mIU/mL)
Women of child bearing potential must be practicing effective contraception implemented during the trial and for at least 28 days following the last dose of study medication
Tromboembolic event (CVA or transient ischemic attack, AMI) less than 3 months prior to the intravitreal injection of bevacizumab
History of hypersensitivity for bevacizumab.

Annotated entities:
- Condition: "pregnant"
- Observation: "breastfeeding"
- Person: "Women"
- Measurement: "human chorionic gonadotropin"
- Procedure: "human chorionic gonadotropin laboratory test"
- Value: "positive"
- Value: "> 5mIU/mL"
- Person: "Women"
- Condition: "child bearing potential"
- Qualifier: "effective"
- Procedure: "contraception"
- Temporal: "during the trial"
- Temporal: "for at least 28 days following the last dose of study medication"
- Multiplier: "last dose"
- Drug: "study medication"
- Reference_point: "the last dose of study medication"
- Condition: "Tromboembolic event"
- Condition: "CVA"
- Condition: "transient ischemic attack"
- Condition: "AMI"
- Temporal: "less than 3 months prior to the intravitreal injection of bevacizumab"
- Procedure: "intravitreal injection"
- Drug: "bevacizumab"
- Reference_point: "the intravitreal injection of bevacizumab"
- Condition: "hypersensitivity"
- Drug: "bevacizumab"
- Temporal: "History"